Clinical trial exclusion criterion:
Body mass index (BMI) < 18.5 kg/m2 or > 25 kg/m2.

Annotated entities:
- Measurement: "Body mass index"
- Measurement: "BMI"
- Value: "< 18.5 kg/m2 or > 25 kg/m2"